Clinical trial exclusion criterion:
ASA 4 or 5

Entity relations:
- Has_value("ASA", "4 or 5")